¿Cuál de los siguientes virus de la hepatitis es subsidiario de tratamiento con inhibidores de la proteasa viral?
1. El virus de la hepatitis C.
2. El virus de la hepatitis B.
3. El virus de la hepatitis A.
4. El virus de la hepatitis E.
5. El virus TTV.

Respuesta correcta: 1. El virus de la hepatitis C.